Current use of Thioridazine

The above is a clinical trial exclusion criterion. Annotated with entity spans:
Current use of [Drug: Thioridazine]